3. Individuals living with other family members

The above is a clinical trial inclusion criterion. Annotated with entity spans:
[Parsing_Error: 3.] [Non-query-able: Individuals living with other family members]